Clinical trial exclusion criterion:
6. Is highly exuding (i.e. requires daily change of dressing)

Annotated entities:
- Parsing_Error: "6."
- Qualifier: "highly exuding"
- Subjective_judgement: "highly exuding"
- Multiplier: "daily"
- Procedure: "change of dressing"